下列有關化學滲透模式（chemiosmotic model）的敘述，何者正確？
A. 此模式成立時，粒線體的內膜可讓質子（proton）自由滲透
B. 此模式預測氧化磷酸化反應，可以在粒線體不存在時進行
C. 電子傳遞的過程中，伴隨著質子跨過膜的傳遞，因而產生了膜電位（membrane potential）及ΔpH
D. 2,4 二硝基苯酚（2,4-dinitrophenol）可以攜帶電子自由穿透粒線體內膜

正確答案：C. 電子傳遞的過程中，伴隨著質子跨過膜的傳遞，因而產生了膜電位（membrane potential）及ΔpH